甲狀腺懸後韌帶附在氣管上，此韌帶又叫：
A. coronary ligament
B. triangular ligament
C. Berry's ligament
D. belt ligament

正確答案：C. Berry's ligament